Clinical trial exclusion criterion:
Serum Alanine Aminotransferase (ALT) > triple the upper limit of the normal range; and/or

Entity relations:
- Subsumes("Serum Alanine Aminotransferase", "ALT")
- Has_value("Serum Alanine Aminotransferase", "> triple the upper limit of the normal range")
- OR("Serum Alanine Aminotransferase")